Clinical trial inclusion criterion:
use of basal-bolus insulin

Annotated entities:
- Drug: "basal-bolus insulin"